下列有關肺部非典型類癌（Atypical carcinoid）之敘述，何者錯誤？
A. 大部分發生在葉支氣管（Lobar bronchus）
B. 可能有淋巴腺或血管侵犯或轉移
C. 常見伴有 Carcinoid syndrome
D. 病理可見細胞多形化（Pleomorphic）與分裂（Mitosis）增多之情形

正確答案：C. 常見伴有 Carcinoid syndrome